Clinical trial exclusion criterion:
poor health due to a current or past significant disease state or congenital abnormality.

Entity relations:
- Has_temporal("significant disease state", "current")
- OR("current", "past")
- OR("significant disease state", "congenital abnormality")